Evidence or suspicion of upper gastrointestinal bleed (GIB)

The above is a clinical trial inclusion criterion. Annotated with entity spans:
[Mood: Evidence] or [Mood: suspicion] of [Condition: upper gastrointestinal bleed (GIB)]